Clinical trial inclusion criterion:
Adult patients scheduled for arthroscopic knee ligament reconstruction

Annotated entities:
- Person: "Adult"
- Mood: "scheduled"
- Procedure: "arthroscopic knee ligament reconstruction"